體溫過低的原因最不可能是下列何者？
A. 腦下腺機能低下
B. 副甲狀腺機能低下
C. 腎上腺機能低下（Addison's disease）
D. 腦中風

正確答案：B. 副甲狀腺機能低下